History of autoimmune hepatitis

The above is a clinical trial exclusion criterion. Annotated with entity spans:
[Temporal: History] of [Condition: autoimmune hepatitis]